Clinical trial exclusion criterion:
Those less than 18 years of age.

Entity relations:
- Has_value("age", "less than 18 years")